Un niño de 5 años que presenta síntomas de una posible meningitis, es atendido en un servicio de urgencias. En la tinción de Gram del sedimento del líquido cefalorraquídeo, se observan diplococos Gram negativos y abundantes leucocitos polimorfonucleados. ¿Qué microorganismo nos sugiere como posible causa de la infección?:
1. Haemophilus influenzae.
2. Streptococcus pneumoniae.
3. Streptococcus agalactiae.
4. Neisseria meningitidis.
5. Listeria monocitogenes.

Respuesta correcta: 4. Neisseria meningitidis.